En relación con los tumores mucinosos papilares intraductales de páncreas, señalar el enunciado INCORRECTO:
1. Son tumores potencialmente malignos.
2. Su frecuencia se ha              incrementado notablemente en la última década.
3. Se distinguen tres subtipos: de conducto principal, de conducto secundario y mixto.
4. Deben ser extirpados tan pronto como se diagnostiquen, excepto la variedad de conducto principal.
5. Su primera manifestación clínica puede ser un cuadro de pancreatitis aguda.

Respuesta correcta: 4. Deben ser extirpados tan pronto como se diagnostiquen, excepto la variedad de conducto principal.